Clinical trial inclusion criterion:
Veteran receiving care within the Veterans Health Administration healthcare system

Entity relations:
- AND("Veteran", "Veterans Health Administration healthcare system")